Clinical trial inclusion criterion:
Stage 3 - 5 Chronic Kidney Disease

Entity relations:
- Has_value("Stage", "3 - 5")
- AND("Chronic Kidney Disease", "Stage")